Clinical trial exclusion criterion:
End stage renal disease (CrCl < 15 ml/min)

Annotated entities:
- Condition: "End stage renal disease"
- Measurement: "CrCl"
- Value: "< 15 ml/min"